下列各種疾病到青少年和成人期變化之敘述，何者錯誤？
A. 注意力不足過動症的症狀可能持續至青少年和成人期
B. 具有注意力不足過動症的家族史、行為規範障礙和負面的生活事件，為預測症狀持續的不利因子
C. 自閉兒若在 5 至 7 歲時有溝通性語言和高於 70 的智商，則預後較佳
D. 部分自閉兒到成年初期（young adulthood）症狀有所改善，以儀式性和重複性的行為改善最多

正確答案：D. 部分自閉兒到成年初期（young adulthood）症狀有所改善，以儀式性和重複性的行為改善最多